Clinical trial exclusion criterion:
Presence of acute fracture

Annotated entities:
- Condition: "fracture"
- Qualifier: "acute"